下列有關李斯特菌（Listeria monocytogenes）的敘述，何者錯誤？
A. 為革蘭氏陽性球菌，可以在 20℃至 25℃的環境成長
B. 好發於孕婦、老年人以及一些免疫功能低下的病人
C. 臨床上表現以菌血症或中樞神經系統的感染居多
D. 藥物治療的首選是 ampicillin 或 penicillin，常合併 aminoglycoside 類藥物協同治療

正確答案：A. 為革蘭氏陽性球菌，可以在 20℃至 25℃的環境成長